Clinical trial exclusion criterion:
Prior history of treatment failure to two previous SSRI trials at appropriate doses and duration

Annotated entities:
- Non-query-able: "Prior history of treatment failure to two previous SSRI trials at appropriate doses and duration"